Clinical trial inclusion criterion:
Patient provides written informed consent.

Annotated entities:
- Informed_consent: "Patient provides written informed consent"